Clinical trial exclusion criterion:
neuropathy/sensory impairment of lower limbs

Entity relations:
- Has_qualifier("neuropathy", "lower limbs")
- OR("neuropathy", "sensory impairment")